Mini-Mental State Exam = 24.

The above is a clinical trial inclusion criterion. Annotated with entity spans:
[Measurement: Mini-Mental State Exam] [Value: = 24].